Clinical trial exclusion criterion:
STEMI due to bypass-graft occlusion

Annotated entities:
- Condition: "STEMI"
- Device: "bypass-graft"
- Condition: "occlusion"